Clinical trial inclusion criterion:
Clinical diagnosis of diabetic nephropathy, with a urinary albumin/creatinine ratio >30 mg/g and an estimated glomerular filtration rate more than 20 ml/min per 1.73 m2.

Annotated entities:
- Condition: "diabetic nephropathy"
- Measurement: "urinary albumin/creatinine ratio"
- Value: ">30 mg/g"
- Measurement: "estimated glomerular filtration rate"
- Value: "more than 20 ml/min per 1.73 m2"